Clinical trial exclusion criterion:
Pregnancy or lactating

Annotated entities:
- Condition: "Pregnancy"
- Condition: "lactating"